3. History of serious ventricular arrhythmia (i.e., ventricular tachycardia or ventricular fibrillation) or cardiac arrhythmias requiring anti-arrhythmic medications, except for atrial fibrillation that is well controlled with anti-arrhythmic medication.

The above is a clinical trial exclusion criterion. Annotated with entity spans:
[Parsing_Error: 3.] [Temporal: History] of [Qualifier: serious] [Condition: ventricular arrhythmia] (i.e., [Condition: ventricular tachycardia] or [Condition: ventricular fibrillation]) or [Condition: cardiac arrhythmias] [Qualifier: requiring anti-arrhythmic medications], [Negation: except] for [Condition: atrial fibrillation] that is [Qualifier: well controlled with anti-arrhythmic medication].